En ausencia de oxígeno, el ciclo del ácido cítrico mitocondrial se inhibe porque:
1. Aumenta la concentración de ADP, un inhibidor de la isocitrato-deshidrogenasa.
2. No se pueden producir las fosforilaciones a nivel de sustrato.
3. No se dispone de piruvato.
4. Se inhibe la ATP-sintasa.
5. No se pueden reoxidar los coenzimas necesarios.

Respuesta correcta: 5. No se pueden reoxidar los coenzimas necesarios.